Clinical trial inclusion criteria:
Patients will be included if they are having an in-patient spinal fusion procedure, are 18 years or older, post and post-operative pain control plan includes opioid medications.

Annotated entities:
- Visit: "in-patient"
- Procedure: "spinal fusion procedure"
- Value: "18 years or older"
- Person: "years"
- Temporal: "post-operative"
- Procedure: "pain control plan"
- Drug: "opioid"